Clinical trial exclusion criterion:
Males planning to conceive a child during the study or within 6 months of cessation of treatment.

Annotated entities:
- Person: "Males"
- Mood: "planning to"
- Observation: "conceive a child"
- Temporal: "during the study"
- Temporal: "within 6 months of cessation of treatment"
- Reference_point: "cessation of treatment"
- Reference_point: "the study"